下列關於關節囊內股骨頸骨折（intracapsular femoral neck fracture）之敘述，何者最正確？
A. Garden type II 股骨頸骨折屬移位性骨折（displaced fracture）
B. 年輕人之股骨頸骨折常見於高能量性創傷（high-energy trauma）
C. 移位性股骨頸骨折之治療原則為開放性復位內固定手術（open reduction and internal fixation）
D. 缺血性壞死（osteonecrosis）是最常見之合併症

正確答案：B. 年輕人之股骨頸骨折常見於高能量性創傷（high-energy trauma）